Clinical trial inclusion criterion:
current regular user of e-cigarettes (use at least once daily for the past 30 days) with nicotine strength > 6mg/ml

Annotated entities:
- Person: "user"
- Qualifier: "regular"
- Qualifier: "e-cigarettes"
- Multiplier: "at least once daily"
- Temporal: "for the past 30 days"
- Measurement: "nicotine strength"
- Value: "> 6mg/ml"